Clinical trial inclusion criteria:
Fluent in reading and writing in English language.
= 21 years of age at the time of participation.

Annotated entities:
- Non-query-able: "Fluent in reading and writing in English language."
- Person: "age"
- Value: "= 21 years"
- Temporal: "at the time of participation"
- Reference_point: "participation"